王先生 78 歲，患高血壓多年，藥物調控一直不好，今天門診血壓為 170/70 mmHg，心跳 80/分，BUN 49.2 mg/dL、Creatinine 4.1 mg/dL、uric acid 7.2 mg/dL、K+ 6.1 mEq/L，下列那一組藥物最適合王先生的治 療 ： ①loop diuretics ②angiotensin-converting enzyme inhibitor ③angiotensin receptor blocker  ④dihydropyridine calcium channel blocker
A. ①②
B. ②③
C. ③④
D. ①④

正確答案：D. ①④